Clinical trial inclusion criterion:
Plan on having continued sexual contact with partner

Annotated entities:
- Mood: "Plan on"
- Observation: "having continued sexual contact with partner"